Clinical trial inclusion criterion:
CHB patients who had received single NAs for more than 12 months.

Entity relations:
- Has_qualifier("NAs", "single")
- AND("CHB", "NAs")
- Has_temporal("NAs", "more than 12 months")